Clinical trial inclusion criterion:
Patients without history of inner ear disease

Annotated entities:
- Condition: "inner ear disease"
- Temporal: "history"
- Negation: "without"